實施中心靜脈壓（CVP）注射時，須摸到股動脈脈搏，在何處下針？
A. 脈搏處內側
B. 脈搏處外側
C. 脈搏處
D. 脈搏處下方

正確答案：A. 脈搏處內側